Clinical trial inclusion criterion:
Taking Clopidogrel 75 mg daily dose for at least 7 days or taking Clopidogrel 75 mg daily dose for less than 7 days but with 300 to 600 mg Clopidogrel loading dose before PCI.

Annotated entities:
- Drug: "Clopidogrel"
- Multiplier: "75 mg"
- Multiplier: "daily"
- Temporal: "for at least 7 days"
- Drug: "Clopidogrel"
- Multiplier: "75 mg"
- Multiplier: "daily"
- Temporal: "for less than 7 days"
- Drug: "Clopidogrel"
- Multiplier: "300 to 600 mg"
- Temporal: "before PCI"
- Reference_point: "PCI"
- Procedure: "PCI"